Clinical trial exclusion criterion:
Weight gain or loss > 5 kg in the last 3 months, ongoing weight-loss diet (hypocaloric diet) or use of weight loss agents.

Annotated entities:
- Measurement: "Weight gain"
- Measurement: "Weight loss"
- Value: "> 5 kg"
- Temporal: "in the last 3 months"
- Observation: "weight-loss diet"
- Temporal: "ongoing"
- Observation: "hypocaloric diet"
- Drug: "weight loss agents"